Clinical trial exclusion criterion:
Patients with previous periorbital/forehead surgery

Annotated entities:
- Procedure: "forehead surgery"
- Procedure: "periorbital surgery"